¿Cuál de los siguientes factores REDUCE la aparición de los procesos de conformidad? :
1. Necesidad de ofrecer respuesta pública.
2. Alta dificultad de los juicio que deben ser emitidos.
3. Grupo de amplio tamaño.
4. Carencia de unanimidad dentro del grupo.

Respuesta correcta: 4. Carencia de unanimidad dentro del grupo.